下列何種情形與鉀離子流失所造成的低血鉀（Hypokalemia）最無關？
A. 注射胰島素（Insulin）
B. 長期使用利尿劑（Long-term usage of diuretics）
C. 腸胃炎引起腹瀉（Gastroenteritis induced diarrhea）
D. 腎小管酸血症 （Renal tubular acidosis）

正確答案：A. 注射胰島素（Insulin）